Clinical trial exclusion criterion:
Has received locoregional therapy to liver (transcatheter chemoembolization [TACE], transcatheter embolization [TAE], hepatic arterial infusion [HAI], radiation, radioembolization, or ablation) or other site within 4 weeks prior to the first dose of study medication

Entity relations:
- Has_index("within 4 weeks prior", "first dose of study medication")
- Has_qualifier("locoregional therapy", "liver")
- Subsumes("locoregional therapy", "transcatheter chemoembolization [TACE]")
- Has_temporal("locoregional therapy", "within 4 weeks prior")
- Subsumes("locoregional therapy", "transcatheter embolization [TAE]")
- Subsumes("locoregional therapy", "hepatic arterial infusion [HAI]")
- Subsumes("locoregional therapy", "radiation")
- Subsumes("locoregional therapy", "radioembolization")
- Subsumes("locoregional therapy", "ablation")
- OR("liver", "other site")